Describe f-scLVM

f-scLVM (factorial single-cell latent variable model) is a method based on factor analysis that uses pathway annotations to guide the inference of interpretable factors underpinning the heterogeneity. It jointly estimates the relevance of individual factors, refines gene set annotations, and infers factors without annotation. In applications to multiple scRNA-seq datasets, f-SCLVM robustly decomposes scRNA -seq datasets into interpretable components, thereby facilitating the identification of novel subpopulations.